Clinical trial inclusion criterion:
Blunt or penetrating trauma

Annotated entities:
- Condition: "penetrating trauma"
- Condition: "Blunt trauma"